Clinical trial exclusion criterion:
More than three doses of any opioid within one week of surgery

Entity relations:
- Has_multiplier("opioid", "More than three doses")
- Has_temporal("opioid", "within one week of surgery")
- Has_index("within one week of surgery", "surgery")